下列那種疾病較不可能導致腦中風？
A. 紅斑性狼瘡
B. 頸動脈剝離
C. 高血壓
D. 類風濕性關節炎

正確答案：D. 類風濕性關節炎